Clinical trial exclusion criterion:
ED Physicians who are routinely using U/S guided RA for hip fracture patients, or decline participation in the trial.

Annotated entities:
- Non-query-able: "ED Physicians who are routinely using U/S guided RA for hip fracture patients, or decline participation in the trial."